下列那一項是調控 arginine vasopressin（AVP）增加分泌最重要的機制？
A. 下視丘的osmoreceptors感受血液滲透壓的增加
B. 心臟的壓力感受器（pressure receptors）感受血液容積或血壓的下降
C. 噁心或嘔吐刺激髓腦的催吐中樞（emetic center in the medulla）
D. 血管升壓素（angiotensin）增加

正確答案：A. 下視丘的osmoreceptors感受血液滲透壓的增加